小腦（Cerebellum）的發育是源自：
A. 髓腦（Myelencephalon）之翼板神經母細胞（neuroblasts of alar plates）
B. 髓腦之基板神經母細胞（neuroblasts of basal plates）
C. 後腦（Metencephalon）之翼板神經母細胞
D. 後腦之基板神經母細胞

正確答案：C. 後腦（Metencephalon）之翼板神經母細胞